Las alteraciones cerebrales que caracterizan la enfermedad del Alzheimer son:
1. Hiperactivación de las neuronas dopaminérgicas de los ganglios basales, provocando muerte neuronal.
2. Degeneración del hipocampo, y de la corteza de los lóbulos frontal y temporal.
3. Deterioro de las neuronas serotoninérgicas de los lóbulos parietal y occipital.
4. Presencia de los cuerpos de Lewy en toda la sustancia blanca subcortical.
5. Acumulación de proteínas prión desnaturalizadas que provocan inflamación en los lóbulos frontal y parietal.

Respuesta correcta: 2. Degeneración del hipocampo, y de la corteza de los lóbulos frontal y temporal.